Contra-indications for alfa-interferon therapy like suspected hypersensitivity to interferon or Peginterferon or any known pre-existing medical condition that could interfere with the patient's participation in and completion of the study.

The above is a clinical trial exclusion criterion. Annotated with entity spans:
[Condition: Contra-indications] for [Drug: alfa-interferon therapy] like suspected [Condition: hypersensitivity] to [Drug: interferon] or [Drug: Peginterferon] or [Non-query-able: any known pre-existing medical condition that could interfere with the patient's participation in and completion of the study].